關於癲癇重積狀態（status epilepticus）的敘述，下列何者錯誤？
A. 定義為癲癇發作持續 60 分鐘以上，或任一次發作完神智 24 小時內未恢復清醒
B. 在成人之抽搐型癲癇重積狀態（convulsive status epilepticus），死亡率高達 7%到 10%
C. 以發燒感染、中風、藥物改變或服藥之遵從性不佳、飲用酒類或其他藥物及新陳代謝異常為發生之主要原因
D. 非抽搐型癲癇重積狀態（nonconvulsive status epilepticus）較常發生於中老年人，且過去多無癲癇病史

正確答案：A. 定義為癲癇發作持續 60 分鐘以上，或任一次發作完神智 24 小時內未恢復清醒